Clinical trial exclusion criterion:
Liver disease (abnormal liver enzymes)

Entity relations:
- Has_value("liver enzymes", "abnormal")
- Subsumes("Liver disease", "liver enzymes")